Clinical trial exclusion criterion:
Major typhoid fever-associated complications

Entity relations:
- Has_qualifier("complications", "typhoid fever-associated")
- AND("typhoid fever-associated", "typhoid fever")